adults 61 years old and above

The above is a clinical trial exclusion criterion. Annotated with entity spans:
[Person: adults] 61 years [Person: old] [Value: and above]